History of allergic reaction to compounds of similar chemical or biologic composition to hCG

The above is a clinical trial exclusion criterion. Annotated with entity spans:
[Temporal: History] of [Condition: allergic reaction] to [Drug: compounds of similar chemical or biologic composition to hCG]